Clinical trial inclusion criterion:
2. hypertriglyceridemia (triglyceride levels of 150 mg⁄dL or greater);

Entity relations:
- Has_value("triglyceride levels", "150 mg⁄dL or greater")
- Subsumes("hypertriglyceridemia", "triglyceride levels")